72 歲的王教授罹患胰臟癌末期，他瘦弱、嚴重黃疸，無法進食，更無法成眠，每天受劇烈腹痛與全身酸痛所折磨，他簽了 DNR，等著解脫，這一週來，王教授更多次哀求您，讓他早點離開人間，下列何種處置適當？
A. 可以打致死劑量的止痛藥（morphine）
B. 按病人疼痛之需求，給予必要劑量的止痛藥
C. 怕導致呼吸抑制不能打止痛藥
D. 送法院裁決安樂死的可行性

正確答案：B. 按病人疼痛之需求，給予必要劑量的止痛藥